Major surgery within 4 weeks

The above is a clinical trial exclusion criterion. Annotated with entity spans:
[Qualifier: Major] [Procedure: surgery] [Temporal: within 4 weeks]